Clinical trial exclusion criterion:
Subjects that are unable to lay flat due to pulmonary complications, increased intracranial pressure (ICP), or unstable spinal cord injuries

Entity relations:
- AND("due to pulmonary complications", "pulmonary complications")
- Has_qualifier("spinal cord injuries", "unstable")
- Has_qualifier("unable to lay flat", "due to pulmonary complications")
- OR("unable to lay flat", "increased intracranial pressure (ICP)", "spinal cord injuries")